Son mecanorreceptores interoceptores secundarios:
1. El corpúsculo de Pacini y de Ruffini.
2. Los botones gustativos.
3. Los receptores del aparato vestibular.
4. Las células ciliadas del órgano de Corti.
5. Los huesos musculares.

Respuesta correcta: 3. Los receptores del aparato vestibular.